Clinical trial exclusion criterion:
Severe allergic reactions in anamnesis of autoimmune disease;

Entity relations:
- Has_qualifier("allergic reactions", "Severe")